Patient is currently enrolled in a Novartis-sponsored, Oncology Clinical Development & Medical Affairs study receiving nilotinib and has fulfilled all their requirements in the parent study

The above is a clinical trial inclusion criterion. Annotated with entity spans:
Patient is [Temporal: currently] [Observation: enrolled in a] [Qualifier: Novartis-sponsored], Oncology Clinical Development & Medical Affairs study receiving [Drug: nilotinib] and [Non-representable: has fulfilled all their requirements in the parent study]